一位 35 歲男性公務員因一個月以來，自覺體力不濟而就醫，無特別過去病史或用藥史。身體診察發現眼結膜蒼白，心跳規則 96/min，無雜音；無黃疸或淋巴結/肝脾腫大，兩下肢可見散在性新舊出血 點。血液常規檢查發現：WBC 1300/μL, N/L/Mo = 5/92/3 %, Hb 7.6 gm/dL, MCV 92.3 fL, Platelet 
 68 mg/dL, ALT/AST: 26/32 U/L, LDH 140 U/L。下列那一項檢查對診斷此病人之血球減少最有幫助？
A. parvovirus B19
B. serum G-6-PD
C. bone marrow biopsy
D. serum ANA

正確答案：C. bone marrow biopsy